Clinical trial exclusion criterion:
Subjects who are unlikely to comply with protocol requirements, e.g. uncooperative attitude, inability to return for the final visit

Annotated entities:
- Non-query-able: "Subjects who are unlikely to comply with protocol requirements, e.g. uncooperative attitude, inability to return for the final visit"
- Post-eligibility: "Subjects who are unlikely to comply with protocol requirements, e.g. uncooperative attitude, inability to return for the final visit"